Clinical trial exclusion criterion:
Aspirin, ticagrelor or clopidogrel allergies;

Entity relations:
- AND("allergies", "Aspirin")
- OR("Aspirin", "clopidogrel", "ticagrelor")